have sleep apnea, or are shift workers

The above is a clinical trial exclusion criterion. Annotated with entity spans:
have [Condition: sleep apnea], or are [Person: shift workers]